Clinical trial exclusion criterion:
Recent history of myocardial infarction, cerebrovascular accident, cardiac arrhythmias, or unstable heart disease.

Annotated entities:
- Temporal: "Recent"
- Temporal: "history"
- Condition: "myocardial infarction"
- Condition: "cerebrovascular accident"
- Condition: "cardiac arrhythmias"
- Condition: "unstable heart disease"